Clinical trial exclusion criterion:
6. Patient has preexisting sphincter problems or evidence of extensive local disease in the pelvis.

Entity relations:
- Has_qualifier("local disease in the pelvis", "extensive")
- Has_mood("local disease in the pelvis", "evidence of")
- OR("sphincter problems", "local disease in the pelvis")